Clinical trial exclusion criterion:
Skin lesions or lesions that have been biopsied previously

Annotated entities:
- Condition: "Skin lesions"
- Condition: "lesions"
- Procedure: "biopsied"
- Temporal: "previously"